為正確診斷非酒精性脂肪肝疾病（nonalcoholic fatty liver disease），下列何項敘述，不是需做肝臟超音波檢查此病的危險因子？
A. 胰島素抗性（insulin resistance）
B. 3歲以上肥胖男童
C. B型肝炎帶原者（hepatitis B carrier）
D. 三酸苷油酯（triglyceride）過高

正確答案：C. B型肝炎帶原者（hepatitis B carrier）